依據美國內科醫學會（The American Board of Internal Medicine）與歐洲內科醫學會（The European  Federation of Internal Medicine）於2002年提出之醫師憲章（Physician Charter）。下列何者不是醫師專業素養之基本原則？
A. 病人福祉優先原則（principle of primacy of patient welfare）
B. 社會正義原則（principle of social justice）
C. 實證醫學執業原則（principle of evidence-based practice）
D. 病人自主原則（principle of patient autonomy）

正確答案：C. 實證醫學執業原則（principle of evidence-based practice）